Clinical trial exclusion criterion:
Profound chorioretinal atrophy in central macular area on ophthalmoscopy and OCT;

Entity relations:
- Has_qualifier("chorioretinal atrophy", "Profound")
- Has_qualifier("chorioretinal atrophy", "central macular area")
- AND("ophthalmoscopy", "chorioretinal atrophy")
- AND("OCT", "chorioretinal atrophy")